What is the target of adalimumab?

Adalimumab is a fully human anti-TNF-alpha monoclonal antibody.